下列關於膀胱輸尿管逆流（Vesicoureteral reflux）的敘述，何者錯誤？
A. 腎盂腎炎常續發於膀胱輸尿管逆流
B. 原發性逆流是因為輸尿管膀胱三角之肌肉先天性較弱
C. 一半以上之兒童逆流可用非手術方法來控制
D. 成人之逆流大多數可用內科療法獲得良好效果

正確答案：D. 成人之逆流大多數可用內科療法獲得良好效果